Clinical trial inclusion criterion:
Willing to have buccal administration of misoprostol or a placebo at least one hour pre-procedure.

Annotated entities:
- Procedure: "buccal administration"
- Drug: "misoprostol"
- Qualifier: "buccal administration"
- Drug: "placebo"
- Temporal: "at least one hour pre-procedure"
- Mood: "Willing to have"